Clinical trial exclusion criterion:
Serum aminotransferase (AST or ALT) 3x upper limit of normal or higher

Entity relations:
- Subsumes("Serum aminotransferase", "AST")
- Has_value("Serum aminotransferase", "3x upper limit of normal or higher")
- OR("AST", "ALT")